Clinical trial inclusion criterion:
Documentation of a CF diagnosis

Annotated entities:
- Condition: "CF"